Clinical trial inclusion criterion:
Age greater than 18

Annotated entities:
- Person: "Age"
- Value: "greater than 18"